Clinical trial exclusion criterion:
Preexisting ocular diseases or conditions other than age related cataracts, have contraindications for cataract surgery;

Entity relations:
- Has_qualifier("cataracts", "age related")
- AND("contraindications", "cataract surgery")
- Has_negation("cataracts", "other than")
- AND("conditions", "cataracts")
- Has_temporal("ocular diseases", "Preexisting")
- OR("ocular diseases", "contraindications", "conditions")